Las halohidrinas vecinales, cuando se tratan con una base se transforman fácilmente en:
1. Dioles.
2. Alquenos.
3. Alcoholes.
4. Epóxidos.
5. Cetonas.

Respuesta correcta: 4. Epóxidos.